Señale qué característica de la dirección de batida del nistagmo es propia de una síndrome vestibular periférico agudo no posicional:
1. Con fijación visual y en posición primaria de la mirada cambia o alterna la dirección de manera espontánea y periódicamente.
2. Con fijación visual cambia de dirección al mirar a uno u otro lado.
3. Con fijación visual y en posición primaria de la mirada es vertical hacia abajo puro, sin componente horizontal.
4. Tanto con fijación visual como al anularla es unidireccional.

Respuesta correcta: 4. Tanto con fijación visual como al anularla es unidireccional.